Impaired glucose regulation diagnostic criteria according to 1998 WHO diagnostic criteria.

The above is a clinical trial inclusion criterion. Annotated with entity spans:
[Condition: Impaired glucose regulation] diagnostic criteria according to [Qualifier: 1998 WHO diagnostic criteria].